Clinical trial inclusion criterion:
No contraindications for mifepristone or misoprostol

Annotated entities:
- Negation: "No"
- Drug: "mifepristone"
- Drug: "misoprostol"
- Mood: "contraindications for"